Which factors are included in the the APPEND score?

APPEND score components are anorexia, migratory Pain, local Peritonism, Elevated C-reactive protein, Neutrophilia and male gender (Dude). It is an acute appendicitis clinical prediction rule.